endocrine diseases: male hypogonadism, hyperthyroidism, adrenal diseases, pituitary diseases

The above is a clinical trial exclusion criterion. Annotated with entity spans:
[Condition: endocrine diseases]: [Condition: male hypogonadism], [Condition: hyperthyroidism], [Condition: adrenal diseases], [Condition: pituitary diseases]